History of Chronic pain or ongoing treatment for chronic pain

The above is a clinical trial exclusion criterion. Annotated with entity spans:
[Temporal: History] of [Condition: Chronic pain] or [Temporal: ongoing] [Procedure: treatment] for [Condition: chronic pain]